¿Con qué ámbito está relacionada la Teoría de la Puerta de Melzack y Wall?:
1. Cáncer.
2. Infección por VIH.
3. Problemas renales.
4. Dolor.
5. Trastornos cardiovasculares.

Respuesta correcta: 4. Dolor.